Clinical trial inclusion criterion:
Clinical diagnosis of diabetic nephropathy, with a urinary albumin/creatinine ratio >30 mg/g and an estimated glomerular filtration rate more than 20 ml/min per 1.73 m2.

Entity relations:
- Has_value("urinary albumin/creatinine ratio", ">30 mg/g")
- Has_value("estimated glomerular filtration rate", "more than 20 ml/min per 1.73 m2")